Clinical trial exclusion criterion:
Dialysis for acute renal failure within the 6 previous months.

Entity relations:
- AND("Dialysis", "acute renal failure")
- Has_temporal("Dialysis", "within the 6 previous months")